Hoehn and Yahr Scale score of 1 - 3

The above is a clinical trial inclusion criterion. Annotated with entity spans:
[Measurement: Hoehn and Yahr Scale score] of [Value: 1 - 3]